Clinical trial inclusion criterion:
Chest x-ray, computerized tomography (CT) scan, or chest magnetic resonance imaging (MRI) with evidence of ongoing infectious or malignant process, obtained within 3 months prior to screening and evaluated by a qualified physician.

Entity relations:
- Has_temporal("infectious", "ongoing")
- AND("Chest x-ray", "infectious")
- Has_temporal("Chest x-ray", "within 3 months prior to screening")
- OR("infectious", "malignant process")
- OR("Chest x-ray", "chest magnetic resonance imaging (MRI)", "computerized tomography (CT) scan")